下列有關酒精性肝病之敘述，何者錯誤？
A. 一般而言，飲用同量之酒，女性比男性之耐受力差，易致肝傷害
B. 一般飲酒後易臉紅、心悸者，代表酒精代謝能力較強
C. 個體對酒精性肝病之易感性與許多酒精代謝酶以及基因多型性有關
D. 酒精性肝硬化患者比病毒性肝硬化患者易產生蜘蛛痣（spider angioma）

正確答案：B. 一般飲酒後易臉紅、心悸者，代表酒精代謝能力較強